Clinical trial exclusion criterion:
Undifferentiated, Anaplastic or Medullary Thyroid Cancer

Entity relations:
- OR("Undifferentiated Thyroid Cancer", "Anaplastic Thyroid Cancer", "Medullary Thyroid Cancer")